Which bacterium has the smallest genome in base pairs yet found?

Nasuia deltocephalinicola, of the phloem-feeding pest insect, Macrosteles quadrilineatus has the smallest bacterial genome yet sequenced (112 kb).